Clinical trial inclusion criterion:
Severe coagulopathy

Annotated entities:
- Condition: "coagulopathy"
- Qualifier: "Severe"